Clinical trial exclusion criteria:
Patient refusal
Allergy to local anaesthesia
Severe coagulopathy
Contralateral phrenic nerve palsy
Local infection
Moderate to severe pulmonary dysfunction (GOLD II, II, IV)

Annotated entities:
- Informed_consent: "Patient refusal"
- Condition: "Allergy"
- Drug: "local anaesthesia"
- Qualifier: "Severe"
- Condition: "coagulopathy"
- Qualifier: "Contralateral"
- Condition: "phrenic nerve palsy"
- Condition: "Local infection"
- Qualifier: "Moderate"
- Qualifier: "severe"
- Condition: "pulmonary dysfunction"
- Measurement: "GOLD"
- Value: "II, II, IV"